Clinical trial inclusion criterion:
General Condition WHO 0, 1 or 2,

Entity relations:
- Has_value("General Condition WHO", "0")
- OR("0", "1", "2")